¿Qué consecuencia de bases del RNA se producirá al transcribirse el fragmento de DNA AGGCCTTTACGC?:
1. TCCGGAAATGCG.
2. AGGCCUUUACGC.
3. UGGCCUUUUGCG
4. UGGCCUUUUCGC.
5. UCCGGAAAUGCG.

Respuesta correcta: 5. UCCGGAAAUGCG.